history of dementia, psychiatric illness or any diseases of central nervous system.

The above is a clinical trial exclusion criterion. Annotated with entity spans:
history of [Condition: dementia], [Condition: psychiatric illness] or any [Condition: diseases of central nervous system].